有關胃食道逆流之敘述，下列何者錯誤？
A. 大部分由食道下括約肌的功能所控制與預防
B. 胃排空時間延長可造成此疾病
C. 正常人絕不會有胃液逆流之現象
D. 下食道括約肌的壓力與長度都能決定胃液逆流

正確答案：C. 正常人絕不會有胃液逆流之現象